下列有關孩童 Grave's disease 的敘述，何者錯誤？
A. 發生率的高峰期在青春期前之孩童
B. 好發於女生
C. 情緒不穩
D. 脈搏壓（pulse pressure）會增加

正確答案：A. 發生率的高峰期在青春期前之孩童